Clinical trial exclusion criterion:
Chronic diathesis

Entity relations:
- Has_qualifier("diathesis", "Chronic")